Couple must have been in a new relationship that started no more than six months prior to study entry

The above is a clinical trial inclusion criterion. Annotated with entity spans:
Couple must have been in a [Observation: new relationship] that started [Temporal: no more than six months prior to study entry]